Clinical trial inclusion criterion:
Persistent dyspnea on daily life (Baseline Dyspnea Index focal score <or= 8).

Annotated entities:
- Condition: "dyspnea on daily life"
- Temporal: "Persistent"
- Temporal: "Baseline"
- Measurement: "Dyspnea Index focal score"
- Value: "<or= 8"